Which are the triad symptoms of pheochromocytoma?

The classic triad of symptoms are episodic headache, excessive sweating (diaphoresis) and palpitation.